28 歲的重度憂鬱症女性因一時想不開而喝下 500 mL 清潔劑，病患送到急診處時，下列的建議處置中何者不恰當？
A. 請家屬回家帶來清潔劑的空瓶
B. 胸部 X 光檢查
C. 予以催吐，以降低黏膜受傷的範圍及程度
D. 安排胃鏡檢查

正確答案：C. 予以催吐，以降低黏膜受傷的範圍及程度